細胞中，下列那種化合物無法直接參與合成 ATP 之反應？
A. 1,3-Bisphosphoglycerate
B. 3-Phosphoglycerate
C. Phosphocreatine
D. Phosphoenolpyruvate

正確答案：B. 3-Phosphoglycerate